關於胸腔出口症候群（thoracic outlet syndrome）的敘述，下列何者錯誤？
A. 多由鎖骨下血管或此區臂神經叢受壓迫而引起
B. 症狀多由神經壓迫引起
C. 中年男性病患較多
D. 治療可先採保守非手術方法

正確答案：C. 中年男性病患較多